El transporte activo:
1. También se denomina difusión facilitada.
2. Lo realizan los canales iónicos.
3. Se produce a favor del gradiente electroquímico.
4. Puede acoplarse a gradientes iónicos.

Respuesta correcta: 4. Puede acoplarse a gradientes iónicos.